下列有關急性中耳炎的治療，何者錯誤？
A. amoxicillin仍為首選之抗生素
B. 若用amoxicillin治療72小時無效，可考慮改成cefuroxime或amoxicillin-clavulanate治療
C. 若中耳積水亦可考慮使用prednisolone
D. 成人急性中耳炎常需手術治療

正確答案：D. 成人急性中耳炎常需手術治療